Clinical trial inclusion criterion:
Aged 25-80 at screening. Subjects older than 80 will be allowed at the discretion of the PI.

Annotated entities:
- Person: "Aged"
- Value: "25-80"
- Non-query-able: "Subjects older than 80 will be allowed at the discretion of the PI"